Which is the transcript responsible for X-chromosome inactivation?

The long non- coding RNA Xist (X inactive specific transcript)